Systemic diseases (diabetes, renal diseases, rheumatic diseases, osteoporosis and cardiovascular diseases)

The above is a clinical trial exclusion criterion. Annotated with entity spans:
[Condition: Systemic diseases] (diabetes, renal diseases, rheumatic diseases, osteoporosis and cardiovascular diseases)